Clinical trial exclusion criterion:
Secondary anxiety disorders

Annotated entities:
- Condition: "Secondary anxiety disorders"